有關流行性感冒（influenza）的敘述，下列何者最不恰當？
A. 流行性感冒的致病原為一種 DNA 病毒
B. 造成全球恐慌的 H5N1 禽流感是一種 A 型流感病毒
C. oseltamivir 可以用來治療 A 型及 B 型流感病毒感染
D. 流行性感冒後可能續發細菌性肺炎，其致病菌以 Streptococcus pneumoniae、Staphylococcus aureus 以及 Haemophilus influenzae 為最常見

正確答案：A. 流行性感冒的致病原為一種 DNA 病毒